Clinical trial exclusion criterion:
Gastrointestinal disorders;

Annotated entities:
- Condition: "Gastrointestinal disorders"